planned elective cholecystectomy

The above is a clinical trial inclusion criterion. Annotated with entity spans:
[Mood: planned] [Qualifier: elective] [Condition: cholecystectomy]